Clinical trial exclusion criterion:
Active and/or chronic protein losing enteropathy or plastic bronchitis (on inhaled medication to control the plastic bronchitis).

Annotated entities:
- Qualifier: "Active"
- Qualifier: "chronic"
- Condition: "protein losing enteropathy"
- Condition: "plastic bronchitis"
- Drug: "inhaled medication"